Cruciate ligament of the knee reconstructive surgery

The above is a clinical trial inclusion criterion. Annotated with entity spans:
[Qualifier: Cruciate ligament of the knee] [Procedure: reconstructive surgery]